有關子宮內膜癌的敘述，下列何者錯誤？
A. 第一型與動情素（estrogen）的刺激較有關
B. 漿液性癌（serous carcinoma）屬於第一型
C. 第二型的預後較不好
D. 子宮內膜增生是第一型的前驅病灶

正確答案：B. 漿液性癌（serous carcinoma）屬於第一型